腦脊髓液檢查的結果，下列那一個組合對診斷多發性硬化症（multiple sclerosis）最有幫助？①蛋白電泳分析出現寡株帶（oligoclonal bands） ②蛋白質降低 ③糖值降低 ④以淋巴球為主的白血球數目增加 ⑤IgG 的合成指數（IgG synthesis index）增加
A. ①②
B. ②④
C. ①⑤
D. ③⑤

正確答案：C. ①⑤